traumatic spinal cord injury at least one year ago

The above is a clinical trial inclusion criterion. Annotated with entity spans:
[Condition: traumatic spinal cord injury] [Temporal: at least one year ago]